Clinical trial exclusion criterion:
Subjects who are unlikely to adhere to the study an/or poor adherence anticipated by the investigator.

Annotated entities:
- Post-eligibility: "Subjects who are unlikely to adhere to the study an/or poor adherence anticipated by the investigator"